Clinical trial inclusion criterion:
6. Haematologic function as follows (5% deviation allowed):

Annotated entities:
- Parsing_Error: "6."
- Parsing_Error: "Haematologic function as follows (5% deviation allowed):"